Son órganos linfoides primarios:
1. Bazo y ganglios linfáticos.
2. El bazo y la médula ósea.
3. El timo y la médula ósea.
4. La glándula pineal.
5. Placas de Peyer y amígdalas.

Respuesta correcta: 3. El timo y la médula ósea.